Clinical trial exclusion criterion:
Who are pregnant or planning to become pregnant during the study or in the future

Entity relations:
- Has_mood("pregnant", "planning to become")
- Has_temporal("pregnant", "during the study")
- OR("pregnant", "pregnant")
- OR("during the study", "in the future")